No signs of poor peripheral perfusion

The above is a clinical trial inclusion criterion. Annotated with entity spans:
[Negation: No] [Mood: signs of] [Condition: poor peripheral perfusion]